Clinical trial inclusion criterion:
Heart disease

Annotated entities:
- Condition: "Heart disease"